下列有關小兒顱骨早期閉合所致顱骨畸型（craniosynostosis）之敘述，何者為非？
A. 矢狀縫（sagittal suture）早期閉合為最常見之病型
B. 矢狀縫早期閉合會造成舟狀頭形（scaphocephaly）
C. Crouzon's 病為人字縫（lambdoid suture）早期閉合
D. 額縫（Metopic suture）早期閉合會造成三角狀頭形（trigonocephaly）

正確答案：C. Crouzon's 病為人字縫（lambdoid suture）早期閉合